Clinical trial exclusion criterion:
Inability to undergo MRI with gadolinium administration

Entity relations:
- AND("MRI", "gadolinium")
- Has_mood("MRI", "Inability to")
- multi("Inability to undergo MRI", "MRI")